Clinical trial inclusion criterion:
healthy parturients with uncomplicated, single gestation pregnancies, full term (38-42 weeks of gestation) pregnancy, agreed to participate

Entity relations:
- Has_qualifier("pregnancies", "single gestation")
- Has_qualifier("pregnancies", "uncomplicated")
- Has_value("weeks of gestation", "38-42")
- Subsumes("full term", "weeks of gestation")
- Has_qualifier("pregnancy", "full term")